血清D-arabinitol含量主要用來偵測下列何種病原菌之感染？
A. Histoplasma capsulatum
B. Penicillium marneffei
C. Cryptococcus neoformans
D. Candida albicans

正確答案：D. Candida albicans